Clinical trial exclusion criterion:
Smoking (current smokers and patients who quit smoking less than six months)

Annotated entities:
- Condition: "Smoking"
- Condition: "smokers"
- Temporal: "current"
- Condition: "quit smoking"
- Temporal: "less than six months"